Clinical trial exclusion criterion:
No major surgery requiring general anaesthesia for at least 3 months prior to the screening visit.

Entity relations:
- AND("major surgery", "general anaesthesia")
- Has_index("for at least 3 months prior to the screening visit", "the screening visit")
- Has_temporal("general anaesthesia", "for at least 3 months prior to the screening visit")
- Has_negation("major surgery", "No")